Clinical trial exclusion criterion:
Severe liver injury.

Entity relations:
- Has_qualifier("liver injury", "Severe")